Si un organismo animal tuviera deficiencias en la ruta de las pentosas fosfato:
1. Habría un exceso de actividad de la enzima glutatión reductasa.
2. Las pentosas fosfato se integrarían en la ruta glicolítica.
3. Se utilizaría NADH en sustitución de NADPH.
4. Se estimularía la síntesis de ácidos grasos en el tejido adiposo.
5. Descendería la concentración de NADPH.

Respuesta correcta: 5. Descendería la concentración de NADPH.